Liver disease caused by an etiology other than HCV

The above is a clinical trial exclusion criterion. Annotated with entity spans:
[Condition: Liver disease] caused by an etiology [Negation: other] than [Observation: HCV]